Clinical trial exclusion criterion:
Present symptoms of other skin diseases, except chronic atopic dermatitis, that could disturb the study assessment and evaluation of the skin

Annotated entities:
- Condition: "skin diseases"
- Condition: "chronic atopic dermatitis"
- Negation: "except"
- Qualifier: "could disturb the study assessment and evaluation of the skin"
- Undefined_semantics: "could disturb the study assessment and evaluation of the skin"